Clinical trial exclusion criterion:
Known to be positive for hepatitis C or hepatitis B surface antigen

Annotated entities:
- Value: "positive"
- Measurement: "hepatitis C"
- Measurement: "hepatitis B surface antigen"